Se le ha considerado el padre de la Toxicología moderna por sus aportaciones clínicas, patológicas y forenses a esta ciencia:
1. Paracelso.
2. Claudio Bernard.
3. Richard Alzheimer.
4. Mateo Orfila.
5. Hipócrates.

Respuesta correcta: 4. Mateo Orfila.